Primary substance exposure in-utero was buprenorphine, or was not opioids

The above is a clinical trial exclusion criterion. Annotated with entity spans:
Primary [Observation: substance exposure] [Qualifier: in-utero] was [Qualifier: buprenorphine], or was [Negation: not] [Drug: opioids]